關於攝食性中毒的急救，下列何者錯誤？
A. 所有病患都建議放胃管洗胃（gastric lavage）
B. 不是所有病人都建議給予活性碳（activated charcoal）
C. 穩定生命現象是急救的第一要務
D. 運送途中建議以左側躺（Left decubitus）姿勢運送

正確答案：A. 所有病患都建議放胃管洗胃（gastric lavage）